What is another name for the drug AMG334?

AMG334 is also called erenumab.